Clinical trial exclusion criteria:
tinnitus or hearing loss with same debut as vertigo
history of bleeding peptic ulcer
glaucoma
pregnancy or non-acceptance to use anticonception measures during 13 days after debut
high blood pressure >180 systolic, 105, diastolic
ketoacidosis with a Base Excess >=2
psychic disorder (not including mild depression)
serious infection (neutropenia, tuberculosis)
chronic otitis
history of vertiginous disease; Ménière, Vertiginous migraine, atypical BPPV

Annotated entities:
- Condition: "tinnitus"
- Condition: "hearing loss"
- Condition: "vertigo"
- Condition: "peptic ulcer"
- Condition: "bleeding"
- Condition: "glaucoma"
- Pregnancy_considerations: "pregnancy or non-acceptance to use anticonception measures during 13 days after debut"
- Measurement: "blood pressure systolic"
- Measurement: "blood pressure diastolic"
- Value: ">180"
- Value: "105"
- Condition: "ketoacidosis"
- Measurement: "Base Excess"
- Value: ">=2"
- Condition: "psychic disorder"
- Negation: "not"
- Condition: "mild depression"
- Condition: "infection"
- Qualifier: "serious"
- Condition: "neutropenia"
- Condition: "tuberculosis"
- Condition: "chronic otitis"
- Condition: "vertiginous disease"
- Condition: "Ménière"
- Condition: "Vertiginous migraine"
- Condition: "atypical BPPV"